Clinical trial exclusion criterion:
Serum albumin < 2.0mg/dL

Entity relations:
- Has_value("Serum albumin", "< 2.0mg/dL")